Clinical trial exclusion criteria:
contra-indications of radiotherapy
angioplasty with stenting

Annotated entities:
- Procedure: "radiotherapy"
- Condition: "contra-indications"
- Procedure: "angioplasty with stenting"